下列何處的神經元負責陰莖的勃起功能（penile erection）？
A. 迷走神經核（dorsal motor nucleus of vagus nerve）
B. 腰髓第一至第二節（L1~L2）之中外細胞柱（intermediolateral cell column）
C. 胸髓第十至第十二節（T10~T12）之中外細胞柱（intermediolateral cell column）
D. 薦髓副交感神經核（sacral parasympathetic nucleus）

正確答案：D. 薦髓副交感神經核（sacral parasympathetic nucleus）